Patients are acute intercurrent illness.

The above is a clinical trial exclusion criterion. Annotated with entity spans:
Patients are [Condition: acute intercurrent illness].